2. Evidence on brain MRI of white matter hyperintensities (leukoaraiosis of moderate or severe degree according to the modified Fazekas visual scale and/or presence of lacunar infarcts).

The above is a clinical trial inclusion criterion. Annotated with entity spans:
[Parsing_Error: 2.] Evidence on [Procedure: brain MRI] of [Observation: white matter hyperintensities] ([Condition: leukoaraiosis] of [Value: moderate or severe degree] according to the [Measurement: modified Fazekas visual scale] and/or presence of [Condition: lacunar infarcts]).